ASA physical status 1 or 2

The above is a clinical trial inclusion criterion. Annotated with entity spans:
[Measurement: ASA physical status] [Value: 1] or [Value: 2]